Clinical trial exclusion criterion:
Except for serious complications (cardiovascular events and recent significant liver, kidney or lung disease within 3 months)

Entity relations:
- Has_qualifier("lung disease", "significant")
- Has_temporal("cardiovascular events", "within 3 months")
- Subsumes("serious complications", "cardiovascular events")
- OR("lung disease", "disease liver", "disease kidney")
- OR("cardiovascular events", "lung disease")